Clinical trial inclusion criteria:
Age between 0 and 18 years
Venous pH less than 7.25
Ketonuria as confirmed on urine point-of-care testing or urinalysis
Hyperglycemia (Serum glucose > 200 mg/dl)
Serum bicarbonate <15 mmol/L
PICU admission

Annotated entities:
- Person: "Age"
- Value: "between 0 and 18 years"
- Measurement: "Venous pH"
- Value: "less than 7.25"
- Condition: "Ketonuria"
- Measurement: "urine point-of-care testing"
- Measurement: "urinalysis"
- Condition: "Hyperglycemia"
- Measurement: "Serum glucose"
- Value: "> 200 mg/dl"
- Measurement: "Serum bicarbonate"
- Value: "<15 mmol/L"
- Visit: "PICU"
- Procedure: "admission"